Clinical trial inclusion criterion:
Participants must present a diagnosis of osteoporosis based on DXA measurement of the bone mineral density at the femur neck and/or total hip and/or lumbar spine (T value 2.5 SD or more below the young female adult mean) within the past 24 months.

Annotated entities:
- Condition: "osteoporosis"
- Procedure: "DXA"
- Measurement: "bone mineral density"
- Qualifier: "femur neck"
- Qualifier: "total hip"
- Qualifier: "lumbar spine"
- Temporal: "past 24 months"
- Measurement: "T value"
- Value: "2.5 SD or more below the young female adult mean"